known allergy to tranexamic acid/Cyklokapron®

The above is a clinical trial exclusion criterion. Annotated with entity spans:
known [Condition: allergy] to [Drug: tranexamic acid]/[Drug: Cyklokapron]®